關於蟹足腫（keloid）的敘述，下列何者錯誤？
A. 穿耳洞也有可能會產生蟹足腫
B. 若手術部位在關節或前胸處，產生蟹足腫的機率，比顏面或腹部來的高
C. 蟹足腫常會合併癢感或痛感
D. 液態氮冷凍不能用於治療蟹足腫

正確答案：D. 液態氮冷凍不能用於治療蟹足腫